Clinical trial inclusion criterion:
2. Females of child-bearing potential (FOCP) must have a negative serum beta human chorionic gonadotropin (HCG) pregnancy test.

Entity relations:
- Has_value("serum beta human chorionic gonadotropin (HCG) pregnancy test", "negative")
- AND("Females", "serum beta human chorionic gonadotropin (HCG) pregnancy test")
- AND("child-bearing potential", "serum beta human chorionic gonadotropin (HCG) pregnancy test")